Clinical trial exclusion criteria:
Emergency surgery
Pregnancy or lactation
Immune disorders
Kidney or liver disease or advanced-stage cardiopulmonary
Patient refusal to participate in the study
Patients under 18 years or inability to consent
Associated neuromuscular disorders, contraindication for the use of rocuronium/ sugammadex, allergy or hypersensitivity to rocuronium / sugammadex

Annotated entities:
- Procedure: "Emergency surgery"
- Condition: "Pregnancy"
- Condition: "lactation"
- Condition: "Immune disorders"
- Condition: "liver disease"
- Condition: "Kidney disease"
- Condition: "advanced-stage cardiopulmonary"
- Informed_consent: "Patient refusal to participate in the study"
- Person: "years"
- Value: "under 18"
- Condition: "inability to consent"
- Informed_consent: "inability to consent"
- Condition: "neuromuscular disorders"
- Condition: "contraindication"
- Drug: "rocuronium"
- Drug: "sugammadex"
- Condition: "allergy"
- Condition: "hypersensitivity"
- Drug: "rocuronium"
- Drug: "sugammadex"